Clinical trial inclusion criterion:
patients affected by mono-lateral symptomatic knee articular degenerative pathology with history of chronic (for at least 4 months) pain or swelling;

Annotated entities:
- Qualifier: "mono-lateral"
- Qualifier: "symptomatic"
- Condition: "knee articular degenerative pathology"
- Condition: "pain"
- Condition: "swelling"
- Temporal: "chronic"
- Temporal: "for at least 4 months"